Clinical trial exclusion criterion:
pregnancy and breast feeding

Annotated entities:
- Pregnancy_considerations: "pregnancy and breast feeding"